Clinical trial exclusion criterion:
clotting factor deficiency

Annotated entities:
- Condition: "clotting factor deficiency"